下列止痛劑何者不具抗發炎作用（anti-inflammatory effect）？
A. acetylsalicylic acid
B. acetaminophen
C. ibuprofen
D. celecoxib

正確答案：B. acetaminophen